具有「膠質原纖維酸性蛋白（glial fibrillar acidic protein, GFAP）」的細胞是：
A. 星狀膠細胞（astrocyte）
B. 腦室襯裏細胞（ependymal cell）
C. 寡突膠細胞（oligodendrocyte）
D. 微膠細胞（microglia）

正確答案：A. 星狀膠細胞（astrocyte）